Clinical trial exclusion criterion:
patients aged>75 years.

Entity relations:
- Has_value("aged", ">75 years")